足月新生兒，身長42 cm、體重 2.3 kg、頭圍偏小、小眼廓、下頜發育不良、上唇薄，下列疾病中最可能的診斷為何？
A. 胎兒酒精症候群（fetal alcohol syndrome）
B. 新生兒戒斷症候群（neonatal abstinence syndrome）
C. 唐氏症（Down syndrome）
D. 威廉氏症候群（Williams syndrome）

正確答案：A. 胎兒酒精症候群（fetal alcohol syndrome）